Pregnant women and infants;

The above is a clinical trial exclusion criterion. Annotated with entity spans:
[Condition: Pregnant] [Person: women] and [Person: infants];